一位28歲女性，這兩年來有頭暈及容易疲倦的症狀，且越來越嚴重而住院治療。入院前八個月，因症狀持續加重，於某醫學中心發現血色素9 g/dL，血球容積92.5 fL，白血球及血小板數目正常，當時肌酸酐為1.3  	mg/dL。住院後血壓140/90 mmHg，脈搏76/分鐘，心臟無雜音，下肢輕微水腫，實	室檢查發現肌酸酐增至
 4 mg/dL，血色素8.5 g/dL，血清儲鐵蛋白（ferritin）591 ng/mL，鐵172 μg/dL，鐵結合總容量為190 μg/dL，大便潛血反應為陰性，尿液檢查無異常，下列何者為此病人腎功能惡化最可能之病變？
A. rapidly progressive glomerulonephritis
B. thrombotic microaniopathy
C. chronic tubulointerstitial disorders
D. hypertensive nephrosclerosis

正確答案：C. chronic tubulointerstitial disorders